Clinical trial exclusion criterion:
eGFR <60 T2DM patients on insulin, GLP-1 RA or SGLT2 treatment Major organ disease type 1 diabetes

Entity relations:
- Has_value("eGFR", "<60")
- OR("insulin", "SGLT2", "GLP-1", "RA")